2. Histologic documentation of the original primary tumor.

The above is a clinical trial inclusion criterion. Annotated with entity spans:
[Parsing_Error: 2.] [Procedure: Histologic] [Value: documentation] of the [Condition: original primary tumor].